Clinical trial exclusion criterion:
Patients with disorders of calcium metabolism and/or hypercalcemia

Annotated entities:
- Condition: "disorders of calcium metabolism"
- Condition: "hypercalcemia"